Clinical trial exclusion criterion:
Heart disease

Annotated entities:
- Condition: "Heart disease"